Clinical trial exclusion criterion:
Current pregnancy

Annotated entities:
- Condition: "pregnancy"
- Temporal: "Current"